ECOG (Eastern Cooperative Oncology Group)score: 0-2

The above is a clinical trial inclusion criterion. Annotated with entity spans:
[Measurement: ECOG (Eastern Cooperative Oncology Group)score]: [Value: 0-2]